Una de las siguientes enzimas está MAL clasificada:
1. Lactato deshidrogenasa - Oxidorreductasa.
2. Quimotripsina – Hidrolasa.
3. Fumarasa – Liasa.
4. Aminoacil-tRNA sintetasa - Ligasa
5. Nucleósido monofosfato quinasa – Isomerasa.

Respuesta correcta: 5. Nucleósido monofosfato quinasa – Isomerasa.